Clinical trial inclusion criteria:
Male or female patients 2 to 16 years of age
Patients who require at least 80% of their caloric intake as PN at study start, and in whom an indication for PN is expected for at least 5 days
Patients who require a central venous line to receive PN or already have a central venous line in place for other reasons
Written informed consent from legal representative(s)

Annotated entities:
- Person: "Male"
- Person: "female"
- Value: "2 to 16 years"
- Person: "age"
- Value: "at least 80% of caloric intake"
- Procedure: "PN"
- Temporal: "at study start"
- Condition: "indication"
- Procedure: "PN"
- Multiplier: "for at least 5 days"
- Mood: "expected"
- Device: "central venous line"
- Procedure: "PN"
- Device: "central venous line"
- Observation: "other reasons"
- Informed_consent: "Written informed consent from legal representative(s)"